Participants should be beneficiary of healthcare coverage under the social security system

The above is a clinical trial inclusion criterion. Annotated with entity spans:
Participants should be [Observation: beneficiary of healthcare coverage] under the social security system